Undergoing abdominoplasty or TRAM flap breast reconstruction

The above is a clinical trial inclusion criterion. Annotated with entity spans:
Undergoing [Procedure: abdominoplasty] or [Procedure: TRAM flap breast reconstruction]